Clinical trial inclusion criterion:
Patients aged from 18 to 65 years old.

Annotated entities:
- Person: "aged"
- Value: "from 18 to 65 years old"